Clinical trial exclusion criterion:
Pregnant females, and

Annotated entities:
- Condition: "Pregnant"
- Person: "females"